Clinical trial exclusion criterion:
Pregnant woman is receiving any drug with antiviral activity or any form of drug therapy for hepatitis B virus

Annotated entities:
- Condition: "Pregnant"
- Person: "woman"
- Drug: "drug with antiviral activity"
- Procedure: "drug therapy"
- Condition: "hepatitis B virus"